Clinical trial inclusion criterion:
1. Women and men ages 18 years and over.

Entity relations:
- Has_value("ages", "18 years and over")
- OR("Women", "men")